Clinical trial inclusion criterion:
Hip fracture surgery scheduled under general anesthesia

Annotated entities:
- Procedure: "Hip fracture surgery"
- Procedure: "general anesthesia"